Clinical trial exclusion criterion:
If Heart disease is present

Annotated entities:
- Condition: "Heart disease"